Subject is incarcerated.

The above is a clinical trial exclusion criterion. Annotated with entity spans:
Subject is [Observation: incarcerated].